Symptoms of COPD: Subjects must score 2 or higher on the modified Medical Research Council Dyspnea scale (Visit 1)

The above is a clinical trial inclusion criterion. Annotated with entity spans:
[Condition: Symptoms of COPD]: Subjects must [Value: score 2 or higher] on the [Measurement: modified Medical Research Council Dyspnea scale] (Visit 1)